Patient has diabetes or is immunodepressed.

The above is a clinical trial exclusion criterion. Annotated with entity spans:
Patient has [Condition: diabetes] or is [Condition: immunodepressed].